Clinical trial inclusion criterion:
Negative urine or serum pregnancy test (for women of childbearing potential) documented within the 24-hour period prior to the first dose of test drug. Additionally, all females must be using reliable contraception during the study and for 3 months after treatment completion

Annotated entities:
- Value: "Negative"
- Measurement: "serum pregnancy test"
- Measurement: "urine pregnancy test"
- Person: "women"
- Condition: "childbearing potential"
- Temporal: "within the 24-hour period prior to the first dose of test drug"
- Reference_point: "the first dose of test drug"
- Pregnancy_considerations: "Additionally, all females must be using reliable contraception during the study and for 3 months after treatment completion"